Age: 20-70 years old;

The above is a clinical trial inclusion criterion. Annotated with entity spans:
[Person: Age]: [Value: 20-70 years old];